Medium or large sized gastric or duodenal varices

The above is a clinical trial exclusion criterion. Annotated with entity spans:
[Qualifier: Medium] or [Qualifier: large] sized [Condition: gastric] or [Condition: duodenal varices]